Use of any oral antidiabetic treatment except for metformin (i.e., sulphonylureas, DPP-IV inhibitors, thiazolidinediones, SGLT-2 inhibitors (Sodium dependent glucose transporter) or GLP-1 analogues (glucagone like peptide) within the last three months prior to Screening

The above is a clinical trial exclusion criterion. Annotated with entity spans:
Use of any [Procedure: oral antidiabetic treatment] [Negation: except for] [Drug: metformin] (i.e., [Drug: sulphonylureas], [Drug: DPP-IV inhibitors], [Drug: thiazolidinediones], [Drug: SGLT-2 inhibitors] (Sodium dependent glucose transporter) or [Drug: GLP-1 analogues] (glucagone like peptide) [Temporal: within the last three months prior to Screening]